Clinical trial exclusion criterion:
History of latex allergy

Annotated entities:
- Condition: "allergy"
- Drug: "latex"
- Temporal: "History"